Patients aged greater than 18 years of age

The above is a clinical trial inclusion criterion. Annotated with entity spans:
Patients [Person: aged] [Value: greater than 18 years] of [Person: age]